Clinical trial inclusion criterion:
Female participants of childbearing potential must have a negative urine or serum pregnancy test within 72 hours prior to receiving the first dose of study therapy

Entity relations:
- Has_temporal("serum pregnancy test", "within 72 hours prior")
- Has_value("serum pregnancy test", "negative")
- AND("Female", "serum pregnancy test")
- Has_index("within 72 hours prior", "receiving the first dose of study therapy")
- AND("Female", "childbearing potential")
- OR("serum pregnancy test", "pregnancy test urine")